Clinical trial inclusion criterion:
biopsy proven NASH

Entity relations:
- AND("biopsy", "NASH")